Clinical trial exclusion criterion:
age under 18y or over 85y

Annotated entities:
- Person: "age"
- Value: "under 18y or over 85y"